marked disability owing to primary generalized or segmental dystonia, despite optimal pharmacologic treatment

The above is a clinical trial inclusion criterion. Annotated with entity spans:
marked [Condition: disability] owing to [Qualifier: primary] [Qualifier: generalized] or [Qualifier: segmental] [Condition: dystonia], despite [Qualifier: optimal] [Procedure: pharmacologic treatment]